Smokers of > 5 cigarettes a day.

The above is a clinical trial exclusion criterion. Annotated with entity spans:
[Person: Smokers] of [Multiplier: > 5] [Observation: cigarettes] a day.